影響卵巢癌最重要的預後因子為：
A. 疾病的分期（stage）
B. 腫瘤的分化（grade）
C. 病人營養狀態
D. 荷爾蒙接受體的多寡

正確答案：A. 疾病的分期（stage）